Clinical trial inclusion criterion:
Aged 5 years to less than 12 years at Visit 1. At least 15 (25%) children of the total study population must be aged 5 to less than 8 years.

Annotated entities:
- Person: "Aged"
- Value: "5 years to less than 12 years"
- Temporal: "at Visit 1"
- Reference_point: "Visit 1"
- Not_a_criteria: "At least 15 (25%) children of the total study population must be aged 5 to less than 8 years."